Hemosiderosis/hemochromatosis ( patients can still be included in the non-ferumoxytol arm)

The above is a clinical trial exclusion criterion. Annotated with entity spans:
[Condition: Hemosiderosis]/[Condition: hemochromatosis] ( patients can still be included in the non-ferumoxytol arm)